Ultrasound scanning at the first visit shows thickness of the achilles tendon above 7 mm or 20% thicker than the contralateral.

The above is a clinical trial inclusion criterion. Annotated with entity spans:
[Procedure: Ultrasound scanning] [Temporal: at the first visit] shows [Condition: thickness of the achilles tendon] [Qualifier: above 7 mm] or [Qualifier: 20% thicker than the contralateral].